Clinical trial exclusion criteria:
All patients who were wheelchair bound preoperatively
All patients who cannot participate in an outpatient physical therapy program for 3 days per week after surgery

Annotated entities:
- Qualifier: "preoperatively"
- Observation: "wheelchair bound"
- Negation: "cannot"
- Procedure: "physical therapy"
- Visit: "outpatient"
- Temporal: "for 3 days per week after surgery"
- Reference_point: "surgery"